Provision of signed and dated informed consent form

The above is a clinical trial inclusion criterion. Annotated with entity spans:
[Post-eligibility: Provision of signed and dated informed consent form]